Previous history of chemical dependence

The above is a clinical trial exclusion criterion. Annotated with entity spans:
[Temporal: Previous] [Temporal: history] of [Condition: chemical dependence]